下列血液中電解質的異常，常會使嬰幼兒心電圖出現QT波之延長（QT Prolongation）的現象，除了：
A. 低血鉀症（hypokalemia）
B. 低血鈉症（hyponatremia）
C. 低血鎂症（hypomagnesemia）
D. 低血鈣症（hypocalcemia）

正確答案：B. 低血鈉症（hyponatremia）